Clinical trial exclusion criterion:
history or records of immunosuppressive therapy (with the exception of topical corticosteroids) for more than 14 days and within 6 months of vaccination

Entity relations:
- Has_negation("topical corticosteroids", "exception")
- Has_temporal("immunosuppressive therapy", "for more than 14 days of vaccination")
- Has_index("within 6 months of vaccination", "vaccination")
- Has_index("for more than 14 days of vaccination", "vaccination")
- Has_temporal("topical corticosteroids", "for more than 14 days of vaccination")
- Has_index("for more than 14 days of vaccination", "vaccination")
- Has_temporal("immunosuppressive therapy", "within 6 months of vaccination")
- Has_temporal("topical corticosteroids", "within 6 months of vaccination")